What is Hikikomori syndrome?

The 'Hikikomori' syndrome (HS) consists of prolonged and severe social withdrawal.